Previous cervical ripening agents (cytotec, cervidil, cervical Foley Balloon)

The above is a clinical trial exclusion criterion. Annotated with entity spans:
[Temporal: Previous] [Drug: cervical ripening agents] ([Drug: cytotec], [Drug: cervidil], [Device: cervical Foley Balloon])